Clinical trial inclusion criterion:
Moderate to severe OSA

Entity relations:
- Has_qualifier("OSA", "Moderate to severe")